Clinical conditions representing a contraindication to intramuscular vaccination and blood draws.

The above is a clinical trial exclusion criterion. Annotated with entity spans:
Clinical conditions representing a [Condition: contraindication] to [Procedure: intramuscular vaccination] and [Procedure: blood draws].